臨床上判斷肺癌無法切除（nonresectability）之情況，不包括下列那一種？
A. 喉返神經麻痺（recurrent laryngeal nerve palsy）
B. 上腔靜脈症候群（superior vena cava syndrome）
C. 主肺動脈侵犯（involvement of main pulmonary artery）
D. Pancoast 症候群侵犯上臂叢（brachial plexus）下支

正確答案：D. Pancoast 症候群侵犯上臂叢（brachial plexus）下支